一位65歲男性主訴倦怠、無力，手腳有刺痛感。身體檢查發現臉色蒼白，有輕微黃疸，舌頭表面平滑，味蕾萎縮；神經學檢查顯示對振動(vibration)的感覺變差。血液檢查顯示血紅素 2 gm/dL，平均紅血球體積110 fL，網狀紅血球1.1%，白血球2780/µL，分類正常，血小板 98000/µL；全膽紅素（bilirubin）2.3 mg/dL，直接型0.5 mg/dL，AST 52 U/L（正常0～ 37），ALT 38 U/L （正常0～41），LDH 780 IU/L（正常140～271）。這位病人最可能的診斷為？
A. aplastic anemia
B. iron deficiency anemia
C. pernicious anemia
D. hemolytic anemia

正確答案：C. pernicious anemia